Clinical trial inclusion criterion:
Age of = 18 years of age and able to give written informed consent;

Annotated entities:
- Person: "Age"
- Value: "= 18 years"
- Observation: "able to give written informed consent"